Which biomarker is widely used in the diagnosis of Ewing sarcoma?

CD99 is a hallmark marker for Ewing sarcoma and primitive neuroectodermal tumors.